已知肝細胞癌（hepatocellular carcinoma, HCC）有不同的etiologic factors，且這些factors在不同地區和國家促成肝癌發生的重要性也不盡相同。以下有關「地區或國家：該地區或國家最重要的etiologic factor of HCC」的組合中，何者正確？
A. Europe & US：Hepatitis B chronic infection and Wilson's disease
B. China：Hepatitis C chronic infection and nonalcoholic steatohepatitis
C. Africa：Aflatoxin B1 and hepatitis B chronic infection
D. Taiwan：Ethanol chronic consumption and primary biliary cirrhosis

正確答案：C. Africa：Aflatoxin B1 and hepatitis B chronic infection